List sirtuin inhibitors.

Sirtinol
nicotinamide (NAM)
LC-0296
BZD9L1